A un paciente diagnosticado de angina de pecho NO le recomendará:
1. Alternar la actividad con periodos de reposo.
2. Tomar nitroglicerina oral por las mañanas.
3. Evitar el frío extremo.
4. Seguir una dieta rica en fibra.
5. Dejar el tabaco.

Respuesta correcta: 2. Tomar nitroglicerina oral por las mañanas.